Clinical trial exclusion criterion:
Females who have high response (estradiol at time of ovulation trigger is > 5000 pg/ml or more than 15 oocytes are retrieved)

Annotated entities:
- Condition: "high response"
- Person: "Females"
- Measurement: "estradiol"
- Temporal: "at time of ovulation trigger"
- Reference_point: "ovulation trigger"
- Value: "> 5000 pg/ml"
- Value: "more than 15"
- Measurement: "oocytes retrieved"